What is the protein that is truncated to produce progerin?

The truncated lamin A protein produced "progerin